Known hypersensitivity or contraindication to any of the following medications: heparin, aspirin, clopidogrel or contrast agents

The above is a clinical trial exclusion criterion. Annotated with entity spans:
Known [Condition: hypersensitivity] or [Condition: contraindication] to any of the following medications: [Drug: heparin], [Drug: aspirin], [Drug: clopidogrel] or [Drug: contrast agents]